Clinical trial exclusion criterion:
mitoxantrone,

Annotated entities:
- Drug: "mitoxantrone"